Individuals with a history of malignancy are ineligible except for the following circumstances. Individuals with a history of malignancy are eligible if they have been disease-free for at least 5 years and are deemed by the investigator to be at low risk for recurrence of that malignancy. Individuals with the following cancer are eligible if diagnosed and adequately treated within the past 5 years: cervical or breast cancer in situ, and basal cell or squamous cell carcinoma of the skin

The above is a clinical trial exclusion criterion. Annotated with entity spans:
Individuals with a [Temporal: history] of [Condition: malignancy] are ineligible except for the following circumstances. Individuals with a history of malignancy are eligible if they have been [Condition: disease-free] [Temporal: for at least 5 years] and are [Subjective_judgement: deemed by the investigator] to be at [Mood: low risk] for [Condition: recurrence of that malignancy]. Individuals with the following cancer [Grammar_Error: are eligible] if [Mood: diagnosed] and [Mood: adequately treated] [Temporal: within the past 5 years]: [Condition: cervical] or [Condition: breast cancer in situ], and [Condition: basal cell] or [Condition: squamous cell carcinoma of the skin]